Clinical trial exclusion criterion:
Patients who already received oral vancomycin or metronidazole (either oral or intravenous) for > 24 hours within the preceding 72 hours at the time of enrollment.

Annotated entities:
- Drug: "vancomycin"
- Drug: "metronidazole"
- Qualifier: "oral"
- Multiplier: "> 24 hours"
- Temporal: "preceding 72 hours at the time of enrollment."
- Reference_point: "enrollment"